Pregnancy or breast-feeding

The above is a clinical trial exclusion criterion. Annotated with entity spans:
[Condition: Pregnancy] or [Observation: breast-feeding]